Clinical trial exclusion criterion:
Clinically significant abnormal liver function tests at screening

Entity relations:
- Has_value("liver function tests", "abnormal")
- Has_qualifier("liver function tests", "Clinically significant")
- Has_index("at screening", "screening")
- Has_temporal("liver function tests", "at screening")